Controla el paso de sustancias al sistema nervioso central:
1. Meninges.
2. Plexo coroideos.
3. Barrera hemato-encefálica.
4. Sustancia blanca.
5. Células de Schwann y oligodendrocitos.

Respuesta correcta: 3. Barrera hemato-encefálica.